Clinical trial exclusion criterion:
Ongoing use of other psoriasis treatment including but not limited to topical or systemic corticosteroids, other topical medications (i.e. coal tar), oral or biologic medications for the treatment of psoriasis, and UV therapy. The following washout periods will be required: 2 weeks for topical therapy; 2 weeks for phototherapy; 12 weeks for biologic or targeted therapies; 4 weeks for other systemic therapies

Entity relations:
- AND("treatment", "psoriasis")
- Subsumes("topical medications", "coal tar")
- Has_temporal("treatment", "Ongoing")
- Subsumes("treatment", "topical corticosteroids")
- OR("topical corticosteroids", "oral medications", "biologic medications", "systemic corticosteroids", "UV therapy", "topical medications")